Clinical trial inclusion criterion:
Osteonecrosis

Annotated entities:
- Condition: "Osteonecrosis"